下列何種自體免疫疾病，主要是由於自體免疫反應性 T 細胞所引起？
A. 自體免疫胰島素-依賴性糖尿病（autoimmune insulin-dependent diabetes mellitus）
B. 全身性紅斑狼瘡（systemic lupus erythematosus）
C. 重症肌無力（myasthenia gravis）
D. Grave 氏病（Grave's disease）

正確答案：A. 自體免疫胰島素-依賴性糖尿病（autoimmune insulin-dependent diabetes mellitus）